Clinical trial exclusion criterion:
taking prescribed gabapentin at the time of admission for CD

Annotated entities:
- Drug: "gabapentin"
- Qualifier: "prescribed"
- Temporal: "at the time of admission for CD"
- Reference_point: "admission for CD"
- Procedure: "admission"
- Procedure: "CD"